Clinical trial exclusion criterion:
secondary adhesive capsulitis (history of significant trauma, rotator cuff tear injury, stroke)

Annotated entities:
- Qualifier: "secondary"
- Condition: "adhesive capsulitis"
- Temporal: "history"
- Qualifier: "significant"
- Condition: "trauma"
- Condition: "rotator cuff tear injury"
- Condition: "stroke"